Clinical trial inclusion criterion:
there is no inoculation history of EV71 vaccine, and there is no history of EV71 infection

Entity relations:
- Has_negation("EV71 infection", "no")
- Has_temporal("EV71 infection", "history")
- Has_negation("inoculation", "no")
- AND("inoculation", "EV71 vaccine")
- Has_temporal("inoculation", "history")